Clinical trial inclusion criterion:
admitted for living donor renal transplantation.

Annotated entities:
- Procedure: "living donor renal transplantation"
- Mood: "admitted for"